Patients with symptomatic orthostatic hypertension (the difference in the blood pressures between measured at supine position and measured at standing position is = 20 mmHg for siSBP and = 10 mmHg for siDBP)

The above is a clinical trial exclusion criterion. Annotated with entity spans:
Patients with [Qualifier: symptomatic] [Condition: orthostatic hypertension] (the [Measurement: difference in the blood pressures] between [Qualifier: measured at supine position and measured at standing position] is [Value: = 20 mmHg] for [Measurement: siSBP] and [Value: = 10 mmHg] for [Measurement: siDBP])